Clinical trial inclusion criterion:
Bilirubin < 20.0mg/dL (if Gilberts then < 2.5 mg/dL) and AST/AST < 2.5 ULN

Annotated entities:
- Measurement: "Bilirubin"
- Value: "< 20.0mg/dL"
- Condition: "Gilberts"
- Value: "< 2.5 mg/dL"
- Measurement: "AST/AST"
- Value: "< 2.5 ULN"